Clinical trial inclusion criteria:
ages of 7 and 75 years
marked disability owing to primary generalized or segmental dystonia, despite optimal pharmacologic treatment
disease duration of at least 5 years.

Annotated entities:
- Person: "ages"
- Value: "7 and 75 years"
- Condition: "disability"
- Condition: "dystonia"
- Qualifier: "segmental"
- Qualifier: "generalized"
- Qualifier: "primary"
- Qualifier: "optimal"
- Procedure: "pharmacologic treatment"
- Measurement: "disease duration"
- Value: "at least 5 years"